Clinical trial inclusion criterion:
Able to comply with protocol requirements. Healthy on the basis of a medical evaluation that reveals the absence of any clinically relevant abnormality and includes a physical examination, medical history, electrocardiogram (ECG), vital signs, and the results of blood biochemistry, blood coagulation, and hematology tests and a urinalysis carried out at screening.

Annotated entities:
- Observation: "Able to comply with protocol requirements"
- Condition: "Healthy"
- Procedure: "medical evaluation"
- Negation: "absence"
- Qualifier: "clinically relevant"
- Condition: "abnormality"
- Procedure: "physical examination"
- Procedure: "medical history"
- Procedure: "electrocardiogram"
- Procedure: "vital signs"
- Procedure: "ECG"
- Procedure: "blood biochemistry tests"
- Procedure: "blood coagulation tests"
- Procedure: "hematology tests"
- Procedure: "urinalysis"
- Temporal: "at screening"
- Reference_point: "screening"